Clinical trial exclusion criterion:
Hypertension (BP>140/90 mmHg);

Entity relations:
- Has_value("BP", ">140/90 mmHg")
- AND("Hypertension", "BP")